Inability to give informed consent

The above is a clinical trial exclusion criterion. Annotated with entity spans:
[Informed_consent: Inability to give informed consent]